6. Pregnant or lactating

The above is a clinical trial exclusion criterion. Annotated with entity spans:
[Parsing_Error: 6.] [Condition: Pregnant] or [Condition: lactating]